Clinical trial inclusion criterion:
2. CEAP Classification Stage 6

Annotated entities:
- Parsing_Error: "2."
- Measurement: "CEAP Classification"
- Value: "Stage 6"